Rickettsia felis was described as a human pathogen almost two decades ago, what is it's main arthropod vector?

Cat fleas (Ctenocephalides felis) carrying Rickettsia felis and Bartonella species in Hong Kong